Clinical trial exclusion criterion:
Proteinuria >1 gram/day at time of possible conversion

Annotated entities:
- Measurement: "Proteinuria"
- Value: ">1 gram/day"
- Temporal: "at time of possible conversion"